Clinically significant apathy for at least four weeks for which either 1) the frequency of apathy as assessed by the Neuropsychiatric Inventory (NPI) is 'Very frequently', or 2) the frequency of apathy as assessed by the NPI is 'Frequently' or 'Often' AND the severity of apathy as assessed by the NPI is 'Moderate' or 'Marked'

The above is a clinical trial inclusion criterion. Annotated with entity spans:
Clinically significant [Condition: apathy] for [Person: at least four weeks] for which either 1) the [Observation: frequency of apathy] as assessed by the [Measurement: Neuropsychiatric Inventory (NPI)] is '[Value: Very frequently]', or 2) the [Observation: frequency of apathy] as assessed by the [Measurement: NPI] is '[Value: Frequently]' or '[Value: Often]' AND the [Observation: severity of apathy] as assessed by the [Measurement: NPI] is '[Value: Moderate]' or '[Value: Marked]'